Clinical trial exclusion criterion:
hemodialysis or peritoneal dialysis

Annotated entities:
- Procedure: "hemodialysis"
- Procedure: "peritoneal dialysis"